3. A history of cardiac disease, as defined by:

The above is a clinical trial exclusion criterion. Annotated with entity spans:
3. A [Temporal: history] of [Condition: cardiac disease], [Parsing_Error: as defined by]: